Clinical trial exclusion criterion:
16) Presence of non-MR compatible implants, pregnancy or severe claustrophobia.

Entity relations:
- Has_qualifier("claustrophobia", "severe")
- OR("non-MR compatible implants", "claustrophobia", "pregnancy")